Clinical trial exclusion criterion:
Presence of intracardiac thrombus, myxoma, tumor, interatrial baffle or patch or other abnormality that precludes vascular access, or manipulation of the catheter.

Annotated entities:
- Condition: "intracardiac thrombus"
- Condition: "myxoma"
- Condition: "tumor"
- Condition: "interatrial baffle"
- Device: "patch"
- Qualifier: "other"
- Condition: "abnormality"
- Procedure: "vascular access"
- Procedure: "manipulation of the catheter"
- Condition: "precludes"